晚期或轉移性腎細胞癌常用的單一藥物治療，經證實可能有效者，不包括下列何種藥物？
A. interferon-alpha
B. steroids
C. sunitinib
D. sorafenib

正確答案：B. steroids